Creatinine level >1.5 mg/dL or dependence on dialysis

The above is a clinical trial exclusion criterion. Annotated with entity spans:
[Measurement: Creatinine level] [Value: >1.5 mg/dL] or dependence on [Procedure: dialysis]